Foot ulcer at the malleoli area between 0,25 cm² and 5,0 cm²

The above is a clinical trial inclusion criterion. Annotated with entity spans:
[Condition: Foot ulcer] at the [Qualifier: malleoli area] [Value: between 0,25 cm² and 5,0 cm²]